Clinical trial inclusion criterion:
presence of stress urinary or urgency incontinence

Annotated entities:
- Condition: "urgency incontinence"
- Condition: "stress urinary incontinence"